Clinical trial exclusion criterion:
Contraindications to etomidate (sepsis, primary or secondary adrenal insufficiency, porphyria)

Entity relations:
- AND("Contraindications", "etomidate")
- OR("primary", "secondary")